下列何者不是胃食道逆流疾病（gastroesophageal reflux disease, GERD）的檢查？
A. 分泌激素試驗（secretin test）
B. 食道內視鏡（esophagoscopy）
C. 食道酸鹼度（pH）檢查
D. 黏膜切片（mucosal biopsy）

正確答案：A. 分泌激素試驗（secretin test）